NMDA receptor 亦為離子通道，開啟時下列何種離子可通過？
A. 僅鈉
B. 僅鈉與鉀
C. 僅鈉與鈣
D. 鈉、鉀與鈣

正確答案：D. 鈉、鉀與鈣